En cuidados críticos se utiliza la Clorhexidina como antiséptico. Respecto a la misma, señale la respuesta correcta:
1. Es un bactericida de potencia intermedia, de efecto muy rápido y tiene poca eficacia frente a hongos y virus.
2. Es un bactericida de potencia intermedia, su efecto dura pocos minutos y tiene gran eficacia frente a hongos y virus.
3. Es un bactericida que produce la rotura de la membrana celular, con un efecto muy rápido y duradero, con pobre acción frente al bacilo de Koch.
4. Actúa por oxidación, con un efecto muy lento y duradero, activo frente a grampositivos y gramnegativos.

Respuesta correcta: 3. Es un bactericida que produce la rotura de la membrana celular, con un efecto muy rápido y duradero, con pobre acción frente al bacilo de Koch.